Clinical trial inclusion criteria:
Above 18 years of age
Symptomatic, permanent AF of at least three months duration
Resting heart rate =80 bpm
Signed informed consent

Annotated entities:
- Person: "age"
- Value: "Above 18 years"
- Qualifier: "Symptomatic"
- Qualifier: "permanent"
- Condition: "AF"
- Multiplier: "at least three months duration"
- Measurement: "Resting heart rate"
- Value: "=80 bpm"
- Informed_consent: "Signed informed consent"